Clinical trial exclusion criterion:
ALT or AST >= 1.5 x ULN

Annotated entities:
- Value: ">= 1.5 x ULN"
- Measurement: "AST"
- Measurement: "ALT"